Clinical trial inclusion criterion:
10. Willing to refrain from use of vaginal products or objects within 14 days prior to enrollment and for the duration of the study

Annotated entities:
- Mood: "Willing"
- Drug: "vaginal products"
- Drug: "objects vaginal"
- Temporal: "within 14 days prior to enrollment"
- Temporal: "for the duration of the study"
- Reference_point: "enrollment"
- Reference_point: "the study"
- Negation: "refrain"